Clinical trial exclusion criterion:
evidence of arthritis on x-ray,

Entity relations:
- AND("x-ray", "arthritis")
- Has_mood("arthritis", "evidence of")